下列那一種細菌造成的疾病會形成偽膜（pseudomembrane）而妨礙呼吸？
A. 白喉棒狀桿菌（Corynebacterium diphtheriae）
B. 百日咳桿菌（Bordetella pertusis）
C. 破傷風桿菌（Clostridium tetani）
D. 肺炎鏈球菌（Streptococcus pneumoniae）

正確答案：A. 白喉棒狀桿菌（Corynebacterium diphtheriae）